Where are Goblet cells localized?

Goblet cells are found in the intestine, in the lungs, in the eyes etc. Goblet cells are localized in the epithelium.